Suffering major events or having mood swings.

The above is a clinical trial exclusion criterion. Annotated with entity spans:
Suffering [Condition: major events] or having [Condition: mood swings].